2. Diagnosis: Diagnosis of spastic CP confirmed by a pediatric neurologist or pediatric rehabilitation specialist.

The above is a clinical trial inclusion criterion. Annotated with entity spans:
[Parsing_Error: 2.] Diagnosis: Diagnosis of [Condition: spastic CP] confirmed by a pediatric neurologist or pediatric rehabilitation specialist.